Preoperative use of an anticoagulant (Plavix, warfarin, lovenox, etc.)

The above is a clinical trial exclusion criterion. Annotated with entity spans:
[Temporal: Preoperative] use of an [Drug: anticoagulant] ([Drug: Plavix], [Drug: warfarin], [Drug: lovenox], etc.)